Clinical trial exclusion criterion:
use of any sedative hypnotics, tranquilizers, anticonvulsants, antihistamines (except non-sedating), benzodiazepines, clonidine or any medication known to affect dopamine at start of baseline period

Annotated entities:
- Drug: "sedative hypnotics"
- Drug: "tranquilizers"
- Drug: "anticonvulsants"
- Drug: "antihistamines"
- Qualifier: "non-sedating"
- Negation: "except"
- Drug: "benzodiazepines"
- Drug: "clonidine"
- Drug: "medication known to affect dopamine"
- Temporal: "at start of baseline period"